Clinical trial exclusion criterion:
no co-operation or inadequate finnish language skills

Annotated entities:
- Observation: "co-operation"
- Negation: "no"
- Observation: "inadequate finnish language skills"